Clinical trial inclusion criterion:
Good general health ascertained by medical history, physical examination and laboratory determinations, showing no signs of clinically significant findings, except chronic atopic dermatitis

Entity relations:
- Has_qualifier("signs of clinically significant findings", "clinically significant")
- Has_negation("signs of clinically significant findings", "no")
- Has_negation("chronic atopic dermatitis", "except")
- AND("no", "chronic atopic dermatitis")
- Has_qualifier("Good general health", "ascertained by medical history, physical examination and laboratory determinations")